後天免疫缺乏症候群（AIDS）的病人，眼部最常見的伺機性感染（opportunistic infection）為何？
A. 卡波西氏肉瘤（Kaposi's sarcoma）
B. 巨細胞病毒網膜炎（cytomegalovirus retinitis）
C. 隱球菌脈絡膜炎（cryptococcal choroiditis）
D. 肺囊蟲脈絡膜炎（pneumocystis choroiditis）

正確答案：B. 巨細胞病毒網膜炎（cytomegalovirus retinitis）